Clinical trial inclusion criterion:
Diagnosed by preoperative imaging modalities to have a brain tumor (including metastatic brain tumors) or vascular lesions (aneurysm, arteriovenous malformation or arteriovenous fistula) requiring surgical intervention.

Annotated entities:
- Temporal: "preoperative"
- Procedure: "imaging modalities"
- Condition: "brain tumor"
- Condition: "metastatic brain tumors"
- Condition: "vascular lesions"
- Condition: "aneurysm"
- Condition: "arteriovenous malformation"
- Condition: "arteriovenous fistula"
- Procedure: "surgical intervention"